Clinical trial exclusion criterion:
Severe cognitive decline

Annotated entities:
- Qualifier: "Severe"
- Condition: "cognitive decline"